Clinical trial exclusion criterion:
Known allergy or lack of response to mirtazapine.

Entity relations:
- AND("allergy", "mirtazapine")
- OR("allergy", "lack of response")